Clinical trial exclusion criterion:
History of severe untreated asthma, anaphylactic reactions or severe urticaria and/or angioedema

Annotated entities:
- Condition: "asthma"
- Qualifier: "untreated"
- Qualifier: "severe"
- Condition: "anaphylactic reactions"
- Condition: "urticaria"
- Qualifier: "severe"
- Condition: "angioedema"